Clinical trial exclusion criterion:
14. Uncontrolled or significant cardiovascular disease

Annotated entities:
- Condition: "cardiovascular disease"
- Qualifier: "Uncontrolled"
- Qualifier: "significant"